Clinical trial exclusion criterion:
History of life threatening allergy, anaphylactic reaction, or systemic response to human plasma derived products.

Annotated entities:
- Condition: "life threatening allergy"
- Qualifier: "life threatening"
- Condition: "anaphylactic reaction"
- Condition: "systemic response to human plasma derived products"
- Qualifier: "human plasma derived"
- Drug: "products"
- Temporal: "History"